Clinical trial exclusion criterion:
Undergone surgery within 3 days prior to the first day of dosing.

Annotated entities:
- Procedure: "surgery"
- Temporal: "within 3 days prior to the first day of dosing"
- Reference_point: "first day of dosing"